Clinical trial exclusion criteria:
Allergy to porphyrins and analogues; Photosensitivity; Porphyria; Allergic constitution;
Scar diathesis;
Pregnancy or unwilling to adopt reliable contraceptive measures during the month after drug application;
Be judged not suitable to participate the study by the investigators

Annotated entities:
- Condition: "Allergy"
- Drug: "porphyrins"
- Drug: "porphyrins analogues"
- Condition: "Photosensitivity"
- Condition: "Porphyria"
- Condition: "Allergic constitution"
- Condition: "Scar diathesis"
- Pregnancy_considerations: "Pregnancy or unwilling to adopt reliable contraceptive measures during the month after drug application"
- Post-eligibility: "Be judged not suitable to participate the study by the investigators"